Subjects who will be inaccessible due to geographic or social factors during treatment or follow-up

The above is a clinical trial exclusion criterion. Annotated with entity spans:
Subjects who will be [Observation: inaccessible] due to geographic or social factors [Temporal: during treatment or follow-up]